Clinical trial inclusion criterion:
ECOG Performance Status 0-1

Annotated entities:
- Measurement: "ECOG Performance Status"
- Value: "0-1"